Clinical trial exclusion criterion:
Allergy to bupivacaine.

Annotated entities:
- Condition: "Allergy"
- Drug: "bupivacaine"